Clinical trial exclusion criterion:
Use of therapeutic or recreational drugs influencing plasmatic coagulation

Annotated entities:
- Non-query-able: "Use of therapeutic or recreational drugs influencing plasmatic coagulation"